Clinical trial inclusion criterion:
Measurable metastatic disease (>1cm) in at least one site other than bone-only

Entity relations:
- Has_qualifier("metastatic disease", "Measurable")
- Has_qualifier("at least one", "site other than bone-only")
- AND("at least one", "metastatic disease")
- OR("Measurable", ">1cm")